Clinical trial inclusion criterion:
HBsAg and HBeAg positive for more than 6 months, HBV DNA detectable with ALT level abnormal lasted for three months and at least time190 IU/L or liver puncture biopsy demonstrated apparent inflammation, never treated before enrolled.

Entity relations:
- Has_temporal("HBsAg positive", "for more than 6 months")
- Has_value("ALT level", "abnormal")
- Has_temporal("abnormal", "lasted for three months")
- Has_value("ALT level", "190 IU/L")
- Has_temporal("190 IU/L", "at least time")
- Has_temporal("treated", "before enrolled")
- multi("enrolled", "enrolled")
- Has_index("before enrolled", "enrolled")
- Has_negation("treated", "never")
- AND("liver puncture biopsy", "inflammation")
- AND("HBV DNA detectable", "ALT level")
- AND("inflammation", "treated")
- OR("HBsAg positive", "HBeAg positive", "HBV DNA detectable", "liver puncture biopsy")